Si la velocidad de filtración glomerular es 125 ml/min y el aclaramiento plasmático de una sustancia “X” es de 80 ml /min, la sustancia “X”:
1. Sólo se filtra.
2. Se filtra y se reabsorbe.
3. Se filtra y se secreta.
4. Solo se secreta.

Respuesta correcta: 2. Se filtra y se reabsorbe.